current prohibited concomitant medication

The above is a clinical trial exclusion criterion. Annotated with entity spans:
[Temporal: current] [Qualifier: prohibited] [Temporal: concomitant] [Drug: medication]